Anticoagulant therapy during the past 1 week of the procedure

The above is a clinical trial exclusion criterion. Annotated with entity spans:
[Drug: Anticoagulant] therapy [Temporal: during the past 1 week] of the [Procedure: procedure]